JMC paciente de 14 años de edad que ingresa en el servicio de Urgencias. El médico que le atiende considera necesaria una transfusión sanguínea. Los padres del paciente manifiestan su negativa a que se le administre sangre, firmando el correspondiente documento de denegación a la transfusión. El facultativo le advierte que de no llevarse a cabo la transfusión peligra su vida. Insisten en su negativa, el motivo alegado para el rechazo es básicamente religioso. ¿Cual de las siguientes opciones sería la más correcta?
1. Transfundir al paciente.
2. Transfundir al paciente, pero sólo cuando hubiera perdido la conciencia.
3. Trasladar el caso al comité de ética asistencial para que adopte la decisión.
4. Respetar la preferencia manifestada y atenderle sin realizar la transfusión
5. Lo pondría en conocimiento del juez y no administraría tratamiento alguno hasta que éste lo indicara.

Respuesta correcta: 5. Lo pondría en conocimiento del juez y no administraría tratamiento alguno hasta que éste lo indicara.